中國人靜脈血栓症盛行率遠比白種人低，因為中國人罕見下列那項疾病？
A. 抗磷脂症候群（antiphospholipid syndrome）
B. S 蛋白缺乏（protein S deficiency）
C. 高半胱胺酸血症（hyperhomocysteinemia）
D. 活化 C 蛋白抵抗（activated protein C resistance）

正確答案：D. 活化 C 蛋白抵抗（activated protein C resistance）